Which histone modifications are associated with constitutive heterochromatin?

H3K9 methylation
H3S10 phosphorylation
H3K79 and H4K20 methylation